Participation in other interventional clinical trials, including those with other investigational agents not included in this trial, within 30 days of the start of this trial and throughout the duration of this trial. Non-interventional trials (that is, observational trials) are permitted at any time point.

The above is a clinical trial exclusion criterion. Annotated with entity spans:
[Competing_trial: Participation in other interventional clinical trials], including those with other investigational agents not included in this trial, [Temporal: within 30 days of the start of this trial] and [Temporal: throughout the duration of this trial]. Non-interventional trials (that is, observational trials) are permitted at any time point.